Clinical trial exclusion criterion:
Recreational drug use within 2 years before Screening

Entity relations:
- Has_temporal("Recreational drug use", "within 2 years before Screening")
- Has_index("within 2 years before Screening", "Screening")